Clinical trial inclusion criterion:
Written consent signed

Annotated entities:
- Informed_consent: "Written consent signed"